Clinical trial exclusion criterion:
patients undergoing other bariatric procedures

Annotated entities:
- Procedure: "bariatric procedures"
- Qualifier: "other"
- Temporal: "undergoing"